Clinical trial exclusion criterion:
With other hemorrhagic diseases and anticoagulant therapy is not allowed;

Entity relations:
- Has_qualifier("hemorrhagic diseases", "other")
- AND("anticoagulant therapy", "not allowed")
- AND("hemorrhagic diseases", "anticoagulant therapy")